Patients taking high potency opioid analgesics (e.g., methadone, hydromorphone, morphine)

The above is a clinical trial inclusion criterion. Annotated with entity spans:
Patients taking [Drug: high potency opioid analgesics] (e.g., [Drug: methadone], [Drug: hydromorphone], [Drug: morphine])